Clinical trial inclusion criterion:
with at least 1 sound and fully erupted permanent first molar

Annotated entities:
- Multiplier: "at least 1"
- Qualifier: "sound"
- Qualifier: "fully erupted"
- Condition: "permanent first molar"